What is the mechanism of action of Brigatinib?

Brigatinib targets anaplastic lymphoma kinase. It is used for treatment of lung cancer (NSCLC).